List sclerostin interaction partners.

alkaline phosphatase
carbonic anhydrase
gremlin-1
fetuin A
midkine
annexin A1 
annexin A2
collagen α1
casein kinase II 
secreted frizzled related protein 4
Phex
asporin
follistatin
erbB-3
LRP5 
noggin